Clinical trial exclusion criterion:
8. Pap smear result at screening that requires cryotherapy, biopsy, treatment (other than for infection), or further evaluation

Annotated entities:
- Measurement: "Pap smear"
- Temporal: "at screening"
- Value: "requires cryotherapy"
- Value: "requires biopsy"
- Value: "requires treatment"
- Procedure: "cryotherapy"
- Procedure: "biopsy"
- Procedure: "treatment"
- Value: "requires further evaluation"
- Procedure: "further evaluation"